Written informed consent.

The above is a clinical trial inclusion criterion. Annotated with entity spans:
[Informed_consent: Written informed consent.]